Clinical trial inclusion criterion:
Subjects who the investigator believes that they can and will comply with the requirements of the protocol should be enrolled in the study.

Annotated entities:
- Observation: "can and will comply with the requirements of the protocol"